關於注意力缺損／過動疾患（attention-deficit/hyperactivity disorder）何者錯誤？
A. 過動症狀比注意力問題較早改善
B. 到成人時期仍然有部分患者有注意力缺損問題
C. 注意力缺損／過動疾患治療之統合分析結果顯示，非藥物治療之療效遠優於藥物治療
D. 易共病物質使用相關疾患

正確答案：C. 注意力缺損／過動疾患治療之統合分析結果顯示，非藥物治療之療效遠優於藥物治療